Clinical trial exclusion criterion:
Use of an investigational agent within 30 days.

Annotated entities:
- Drug: "investigational agent"
- Temporal: "within 30 days"